有一位 52 歲男性由於升結腸癌，接受右側大腸切除術，病理報告是腺癌侵犯到部分肌肉層（muscularis propria），淋巴結 17 個有 3 個有轉移，則這病人的 Dukes' classification（Astler-coller modification）是？
A. B1
B. B2
C. C1
D. C2

正確答案：C. C1